Clinical trial exclusion criterion:
Body mass index more than 35

Entity relations:
- Has_value("Body mass index", "more than 35")